關於眼瞼痙攣（essential blepharospasm）的敘述，下列何者錯誤？
A. 大多數為單眼發作
B. 好發於中老年女性
C. 臨床表現需和乾眼症做鑑別診斷
D. 可以用注射肉毒桿菌素（botulinum toxin）改善症狀

正確答案：A. 大多數為單眼發作